Clinical trial inclusion criterion:
Elective Cardiac surgery

Annotated entities:
- Device: "Elective Cardiac surgery"